35歲男性病患，主訴右耳最近幾天聽力下降，且有閉脹感覺，下列何者是應立即先做的檢查？
A. 耳鏡檢查（otoscopic examination）
B. 音叉檢查（tuning fork evaluation）
C. 鼓室圖檢查（tympanometric examination）
D. 聽力檢查（audiometry）

正確答案：A. 耳鏡檢查（otoscopic examination）